Clinical trial inclusion criterion:
Patients with craniotomy for supratentorial tumors under general anesthesia

Annotated entities:
- Procedure: "craniotomy"
- Condition: "supratentorial tumors"
- Procedure: "general anesthesia"